Clinical trial inclusion criterion:
non-valvular atrial fibrillation

Annotated entities:
- Condition: "atrial fibrillation"
- Qualifier: "non-valvular"